Patient is eligible for PCI

The above is a clinical trial inclusion criterion. Annotated with entity spans:
Patient is [Mood: eligible] for [Procedure: PCI]